prostatic hypertrophy, stroke, or ulcer in past year

The above is a clinical trial exclusion criterion. Annotated with entity spans:
[Condition: prostatic hypertrophy], [Condition: stroke], or [Condition: ulcer] in past year